以下何種粒徑的粉塵最易進入肺泡引起傷害？
A. 0.001－0.01 微米（µm）
B. 0.01－0.1 微米（µm）
C. 1－10 微米（µm）
D. 10－100 微米（µm）

正確答案：B. 0.01－0.1 微米（µm）